subjects older than 35 years

The above is a clinical trial inclusion criterion. Annotated with entity spans:
subjects [Value: older than 35] [Person: years]